一位 78 歲的男性有一天清晨起床突覺右肩關節劇痛腫脹，照 X-ray 發現在肩關節的軟骨部位有線狀的鈣化。血中的尿酸值 6.8 mg/dL、CRP 4.78 mg/L，最可能的臨床診斷為何？
A. Acute gouty arthritis
B. Osteoarthritis
C. Adhesive capsulitis
D. Pseudogout

正確答案：D. Pseudogout